Pregnant.

The above is a clinical trial exclusion criterion. Annotated with entity spans:
[Condition: Pregnant].